How many copies of TP53 does the elephant genome contain?

In the elephant genome, TP53 is encoded by 20 copies.